No prior use of somatostatin analogues.

The above is a clinical trial inclusion criterion. Annotated with entity spans:
[Negation: No] [Temporal: prior] use of [Drug: somatostatin analogues].